Clinical trial exclusion criterion:
2. Osteoporosis with high risk of pathological fracture

Entity relations:
- Has_qualifier("Osteoporosis", "high risk of pathological fracture")